Clinical trial exclusion criterion:
Current use of medication that may affect voiding (ie- anticholinergics)

Annotated entities:
- Drug: "medication"
- Drug: "anticholinergics"
- Temporal: "Current"
- Condition: "affect voiding"